Clinical trial exclusion criterion:
Patients who are delirious on initial assessment by ED physician or severe dementia

Entity relations:
- Has_index("on initial assessment", "initial assessment")
- Has_temporal("delirious", "on initial assessment")
- Has_qualifier("dementia", "severe")
- OR("delirious", "dementia")